Clinical trial exclusion criterion:
Treatment with insulin

Annotated entities:
- Drug: "insulin"
- Procedure: "Treatment"